下列有關人體感染海獸胃線蟲（Anisakis spp.）的敘述，何者錯誤？
A. 必須經過在2種中間宿主中發育後，才具有感染人之能力
B. 必須檢查糞便內蟲卵才能確認感染
C. 通常吃海水魚生魚片而感染
D. 感染後常引起急性腹痛

正確答案：B. 必須檢查糞便內蟲卵才能確認感染